大腿後肌肉群，由下列何者支配？
A. 脛神經（tibial nerve）
B. 股神經（femoral nerve）
C. 閉孔神經（obturator nerve）
D. 坐骨神經（sciatic nerve）

正確答案：D. 坐骨神經（sciatic nerve）